Patients with severe renal impairment (CLcr = 29 mL/min, or eGFR = 29 mL/min/1.73 m2), or moderate or severe hepatic impairment (Child-Pugh classes B or C).

The above is a clinical trial exclusion criterion. Annotated with entity spans:
Patients with [Qualifier: severe] [Condition: renal impairment] ([Measurement: CLcr] [Value: = 29 mL/min], or [Measurement: eGFR] [Value: = 29 mL/min/1.73 m2]), or [Qualifier: moderate] or [Qualifier: severe] [Condition: hepatic impairment] ([Measurement: Child-Pugh classes] [Value: B] or [Value: C]).